下列關於發炎性腸疾（inflammatory bowel disease）的敘述，何者錯誤？
A. 相較於北歐及美國，亞洲地區的發生率較高
B. 潰瘍性結腸炎（ulcerative colitis）的發炎浸潤多在黏膜層及黏膜下層，持續發炎的結果會造成纖維化；在長
C. 克隆氏症（Crohn's disease）為一慢性、全壁式（ transmural ）的發炎性疾病，可侵犯由口至肛門的任何部
D. 發炎性腸疾患者還可以併發其他的病症，主要包括虹膜炎、鞏膜炎、關節炎、皮膚病變、膽管及膽管周圍炎等

正確答案：A. 相較於北歐及美國，亞洲地區的發生率較高